Clinical trial exclusion criterion:
Life-time history of dependence on cannabis or diagnosis of cannabis use disorder (CUD) according to the DSM 5

Annotated entities:
- Condition: "dependence on cannabis"
- Condition: "cannabis use disorder (CUD)"
- Qualifier: "DSM 5"